Clinical trial exclusion criterion:
Myocardial infarction, cardiac arrest or cardiac failure within 1 year before screening/baseline visit;

Entity relations:
- Has_temporal("Myocardial infarction", "within 1 year before screening/baseline visit")
- OR("Myocardial infarction", "cardiac arrest", "cardiac failure")